蛋白質中的平行鏈（parallel β-stranded）結構比反平行鏈（antiparallel β-stranded）結構較不穩定，原因為何？
A. 平行鏈結構的横向相鄰鏈之間所形成的氫鍵鍵結較弱
B. 平行鏈結構缺少雙硫鍵（disulfide bond）與鄰近的鏈鍵結
C. 平行鏈結構不能如反平行鏈堆疊（stacking）成β-折疊層（β-sheet）
D. 平行鏈結構缺少蛋白質-蛋白質結合區域（protein-protein binding domain）以穩定平行鏈結構

正確答案：A. 平行鏈結構的横向相鄰鏈之間所形成的氫鍵鍵結較弱